What is the mammalian version of arginine vasotocin?

Arginine vasotocin (AVT) is the non-mammalian homolog of arginine vasopressin (AVP)